Clinical trial exclusion criterion:
Anticoagulation

Annotated entities:
- Procedure: "Anticoagulation"